Clinical trial exclusion criterion:
Contraindications to hormonal contraceptive use per package insert, including history of deep vein thrombosis, smoking in women older than 35 years

Entity relations:
- multi("Contraindications to hormonal contraceptive", "hormonal contraceptive")
- Has_context("women", "smoking")
- Has_value("women", "older than 35 years")
- Subsumes("Contraindications to hormonal contraceptive", "deep vein thrombosis")
- OR("deep vein thrombosis", "women")